Clinical trial exclusion criterion:
neurological diseases

Annotated entities:
- Condition: "neurological diseases"